下列何者不是糖尿病酮酸血症的表現？
A. 噁心嘔吐
B. 尿液比重低
C. 血液之 pH 值＜7.0
D. 呼吸急促及心跳加快

正確答案：B. 尿液比重低